3. If female of childbearing potential must be willing to practice sexual abstinence or dual methods of contraception during treatment and for at least 30 days after the last dose of study drug.

The above is a clinical trial inclusion criterion. Annotated with entity spans:
3. If [Person: female] of [Condition: childbearing potential] must be [Observation: willing] to [Procedure: practice sexual abstinence] or [Multiplier: dual] [Procedure: methods of contraception] [Temporal: during treatment] and [Temporal: for at least 30 days after the last dose of study drug].